Clinical trial exclusion criterion:
Patients being admitted to the hospital or those who are deemed too acutely ill for participation (triage level 1 or 2 or as determined by the ED patient care team) will be excluded from the study.

Annotated entities:
- Non-query-able: "Patients being admitted to the hospital or those who are deemed too acutely ill for participation (triage level 1 or 2 or as determined by the ED patient care team) will be excluded from the study."